下列調控酵素活性的方式，何者為不可逆的（irreversible）？
A. 異位調節（allosteric regulation）
B. 共價修飾（covalent modification）
C. 酶原（zymogen）的蛋白水解切割（proteolytic clevage）
D. 非競爭型抑制劑（uncompetitive inhibitor）的結合

正確答案：C. 酶原（zymogen）的蛋白水解切割（proteolytic clevage）